一位 45 歲女性病人，已知帶有 BRCA 突變基因，乳房攝影（mammography）亦呈現異常，經穿針生檢（core needle biopsy）及病理檢查後證實為一侵犯型乳癌，依據目前的醫學知識，由 BRCA 突變導致的乳癌，最可能有下列何種病理特徵？
A. estrogen receptor (ER) (+)，progesterone receptor (PR) (+)，HER2/neu negative
B. estrogen receptor (ER) (+)，progesterone receptor (PR) (-)，HER2/neu positive
C. estrogen receptor (ER) (+)，progesterone receptor (PR) (-)，HER2/neu negative
D. estrogen receptor (ER) (-)，progesterone receptor (PR) (-)，HER2/neu negative

正確答案：D. estrogen receptor (ER) (-)，progesterone receptor (PR) (-)，HER2/neu negative